Clinical trial inclusion criterion:
Written informed consent of parent or guardian

Annotated entities:
- Informed_consent: "Written informed consent of parent or guardian"